Clinical trial exclusion criterion:
Awake resting oxyhemoglobin saturation <89%

Entity relations:
- Has_qualifier("oxyhemoglobin saturation", "resting")
- Has_qualifier("oxyhemoglobin saturation", "Awake")
- Has_value("oxyhemoglobin saturation", "<89%")